Current participation in a clinical trial or in any study that may add significant burden or affect study outcomes

The above is a clinical trial exclusion criterion. Annotated with entity spans:
[Post-eligibility: Current participation in a clinical trial or in any study that may add significant burden or affect study outcomes]